Diarrhea, grade 1 or greater by the National Cancer Institute Common Terminology Criteria for Adverse Events (NCI-CTCAE, version [v] 4.0)

The above is a clinical trial exclusion criterion. Annotated with entity spans:
[Condition: Diarrhea], [Value: grade 1 or greater] by the [Measurement: National Cancer Institute Common Terminology Criteria for Adverse Events] ([Measurement: NCI-CTCAE, version [v] 4.0])